Clinical trial inclusion criterion:
Hemodynamic stable patient

Annotated entities:
- Condition: "Hemodynamic stable"